Clinical trial exclusion criterion:
Pregnancy and breast feeding mother;

Annotated entities:
- Condition: "Pregnancy"
- Observation: "breast feeding"